Clinical trial exclusion criterion:
Subject with active peptic ulceration

Entity relations:
- Has_qualifier("peptic ulceration", "active")